¿Cuál de los siguientes enlaces covalentes no aparece en las proteínas?:
1. Enlace fosfodiéster.
2. Enlace amida.
3. Enlace O-glucosídico.
4. Enlace disulfuro.
5. Enlace de hidrógeno.

Respuesta correcta: 1. Enlace fosfodiéster.